Gustavo acude a Urgencias con lesiones cutáneas y malestar general de varios días de evolución. Tiene lesiones psoriasiformes en tronco con afectación de palmas y plantas. También presenta una inflamación articular asimétrica no supurativa y enrojecimiento ocular bilateral así como erosiones en glande. En la anamnesis posterior Gustavo reconoce un contacto sexual de riesgo 20 días antes. ¿Cuál es su diagnóstico?
1. Infección por VIH.
2. Sífilis secundaria.
3. Síndrome de Reiter.
4. Eritema multiforme.

Respuesta correcta: 3. Síndrome de Reiter.